下列何者可有效地抑制老鼠體內 mRNA 的合成？
A. Erythromycin
B. Alpha-amanitin
C. Tetracycline
D. Rifampicin

正確答案：B. Alpha-amanitin